由細胞核之基因所表現之蛋白質，下列何者不須 targeting 序列（signal）？
A. 分泌性蛋白質
B. 粒線體蛋白質
C. 膜蛋白質
D. 細胞質蛋白質

正確答案：D. 細胞質蛋白質